Clinical trial exclusion criterion:
Extraliver metastases

Annotated entities:
- Condition: "Extraliver metastases"
- Qualifier: "Extraliver"
- Condition: "metastases"